Patient who have active bleeding disorder, such as intracranial hemorrhage, upper gastrointestinal bleeding, hematuria.

The above is a clinical trial exclusion criterion. Annotated with entity spans:
Patient who have [Qualifier: active] [Condition: bleeding disorder], such as [Condition: intracranial hemorrhage], [Condition: upper gastrointestinal bleeding], [Condition: hematuria].